Un paciente con una úlcera venosa en miembros inferiores presenta una sintomatología y manifestaciones clínicas características. Señale la respuesta INCORRECTA:
1. La úlcera suele ser superficial y de aspecto rosáceo.
2. Edema significativo.
3. Claudicación intermitente.
4. Pulsos normales.

Respuesta correcta: 3. Claudicación intermitente.